¿Cuál de las siguientes pruebas de laboratorio es de elección en el diagnóstico de las anemias hemolíticas autoinmunes por anticuerpos calientes?:
1. Test de Ham.
2. Test de Coombs.
3. Test de autohemólisis con glucosa.
4. Test de resistencia osmótica.
5. Electroforesis de las proteínas de membrana.

Respuesta correcta: 2. Test de Coombs.